Patients with heat intolerance

The above is a clinical trial exclusion criterion. Annotated with entity spans:
Patients with [Condition: heat intolerance]